Patient with left sided, colitis or pancolitis.

The above is a clinical trial exclusion criterion. Annotated with entity spans:
Patient with [Qualifier: left sided], [Condition: colitis] or [Condition: pancolitis].